El locus del gen que codifica la cadena ligera lambda de las inmunoglobulinas es:
1. 14q32.
2. 7q22.
3. 22q11.
4. 2p11.

Respuesta correcta: 3. 22q11.